Which genes are associated with Epidermolysis Bullosa Simplex?

In one family studied, inheritance of EBS is linked to the gene encoding keratin 14 Homozygous deletion mutations in the plectin gene (PLEC1) in patients with epidermolysis bullosa simplex associated with late-onset muscular dystrophy. Epidermolysis bullosa simplex (EBS) is a rare genodermatosis resulting from multiple gene mutations, including KRT5 and KRT14.